下列何構造是會陰淺凹（superficial perineal pouch）的上界？
A. 提肛肌筋膜（fascia of the levator ani muscle）
B. 會陰膜（perineal membrane）
C. 淺會陰筋膜（superficial perineal fascia）
D. 球海綿體肌筋膜（fascia of the ischiocavernosus muscle）

正確答案：B. 會陰膜（perineal membrane）